Clinical trial exclusion criterion:
Chronic use of any medication, except homeopathy, and trivial ones, as nasal physiologic solution and vitamins;

Entity relations:
- Has_multiplier("any medication", "Chronic use")
- Subsumes("trivial ones", "nasal physiologic solution")
- Has_negation("homeopathy", "except")
- AND("any medication", "homeopathy")
- Subsumes("trivial ones", "and")
- Has_negation("trivial ones", "except")
- AND("any medication", "trivial ones")
- OR("nasal physiologic solution", "vitamins")